Clinical trial exclusion criterion:
History of cognitive impairment or dysfunction, including a history of dementia, Alzheimer's disease, stroke with residual cognitive deficits, cognitive dysfunction related to alcohol or substance abuse, or cognitive dysfunction related to prior treatment for any cancer.

Annotated entities:
- Condition: "cognitive impairment"
- Condition: "cognitive dysfunction"
- Condition: "dementia"
- Condition: "Alzheimer's disease"
- Condition: "stroke"
- Condition: "residual cognitive deficits"
- Condition: "cognitive dysfunction"
- Condition: "substance abuse"
- Condition: "alcohol abuse"
- Condition: "cognitive dysfunction"
- Procedure: "treatment"
- Temporal: "prior"
- Condition: "cancer"
- Qualifier: "any"